臺灣地區先天性腎上腺增生（congenital adrenal hyperplasia）的新生兒篩檢是測定嬰兒血片的：
A. ACTH
B. cortisol
C. 17-hydroxyprogesterone
D. 21-hydroxylase enzyme activity

正確答案：C. 17-hydroxyprogesterone